Clinical trial exclusion criterion:
Use of drugs known to increase the risk for cardiac valvulopathy within 6 months before Screening, including but not limited to pergolide, ergotamine, methysergide, and cabergoline

Annotated entities:
- Drug: "drugs"
- Condition: "cardiac valvulopathy"
- Temporal: "within 6 months before Screening"
- Drug: "pergolide"
- Drug: "ergotamine"
- Drug: "methysergide"
- Drug: "cabergoline"
- Qualifier: "known to increase the risk for cardiac valvulopathy"